Clinical trial exclusion criterion:
Subject has a history of active malignancy: A patient with a history of any invasive malignancy (except non-melanoma skin cancer), unless he/she has been treated with curative intent and there have been no signs or symptoms of the malignancy for at least two (2) years.

Annotated entities:
- Condition: "malignancy"
- Condition: "non-melanoma skin cancer"
- Qualifier: "invasive"
- Condition: "treated with curative intent"
- Negation: "no"
- Condition: "signs or symptoms of the malignancy"
- Temporal: "for at least two (2) years"
- Negation: "except"
- Condition: "active malignancy"
- Temporal: "history"